elective primary total knee arthroplasty

The above is a clinical trial inclusion criterion. Annotated with entity spans:
[Qualifier: elective] [Qualifier: primary] [Procedure: total knee arthroplasty]